With immunosuppression (i.e. HIV, lymphoma)

The above is a clinical trial exclusion criterion. Annotated with entity spans:
With [Observation: immunosuppression] (i.e. [Condition: HIV], [Condition: lymphoma])